Use of intravenous amiodarone or lidocaine in the last 24 hours

The above is a clinical trial exclusion criterion. Annotated with entity spans:
Use of [Qualifier: intravenous] [Drug: amiodarone] or [Drug: lidocaine] [Temporal: in the last 24 hours]